Which treatment methods were compared in the EXCEL Trial?

EXCEL trial compared Everolimus Eluting Stent vs. Coronary Artery Bypass Surgery for Effectiveness of Left Main Revascularization.